Clinical trial inclusion criterion:
patients with stable coronary artery disease referred to PCI in an artery suitable for IVUS pullback;

Entity relations:
- Has_mood("PCI", "referred to")
- Has_qualifier("PCI", "artery suitable for IVUS pullback")
- Has_qualifier("coronary artery disease", "stable")